Clinical trial exclusion criterion:
cyclophosphamide,

Annotated entities:
- Drug: "cyclophosphamide"